Patients with chronic kidney disease stage with eGFR < 30 ml/min (CKD stage IV and V)

The above is a clinical trial exclusion criterion. Annotated with entity spans:
Patients with [Condition: chronic kidney disease] stage with [Measurement: eGFR] [Value: < 30 ml/min] ([Condition: CKD] [Qualifier: stage IV] and V)